Patients taking immunosuppressant medication

The above is a clinical trial exclusion criterion. Annotated with entity spans:
Patients taking [Procedure: immunosuppressant medication]